Which type of analysis does DeSeq2 perform?

DeSeq2 performed differential gene expression analysis of paired-end tag sequencing data.